What is another name for  keratomileusis?

Laser in situ keratomileusis  is also known as LASIK